王小姐因感冒、噁心、吃不下飯，到衛生所求診，李醫師處方了咳嗽藥水及止吐藥腹寧朗（Primperan），王小姐服用後約 1 小時，舌頭不自主地吐出來，因此，很慌張地回到衛生所求助，李醫師馬上處理，下列方法何者最不適當？
A. 予以安慰（reassurance），告知不會有大礙，勸慰王小姐放輕鬆，慢慢呼吸，給予催眠（hypnosis）
B. 肌肉注射抗過敏藥物：diphenhydramine
C. 靜脈注射鎮靜劑：diazepam
D. 口服乙型腎上腺素受體阻斷劑（β-adrenergic receptor blocker）：propranolol

正確答案：D. 口服乙型腎上腺素受體阻斷劑（β-adrenergic receptor blocker）：propranolol